Clinical trial inclusion criterion:
Minimal use of nasal decolonization* *Minimal use defined as <15% of residents receiving at least one chlorhexidine bath or nasal decolonization treatment during their nursing home stay.

Annotated entities:
- Multiplier: "Minimal use"
- Procedure: "nasal decolonization"
- Multiplier: "Minimal use"
- Value: "<15%"
- Measurement: "residents receiving at least one chlorhexidine bath"
- Multiplier: "at least one"
- Procedure: "chlorhexidine bath"
- Drug: "chlorhexidine"
- Procedure: "nasal decolonization treatment"
- Temporal: "during their nursing home stay"